Atypical hemolytic uremic syndrome (aHUS) / thrombotic thrombocytopenic purpura syndrome.

The above is a clinical trial exclusion criterion. Annotated with entity spans:
[Condition: Atypical hemolytic uremic syndrome (aHUS)] / [Condition: thrombotic thrombocytopenic purpura syndrome].